hypogonadotropic hypogonadism

The above is a clinical trial exclusion criterion. Annotated with entity spans:
[Condition: hypogonadotropic hypogonadism]